Clinical trial inclusion criterion:
Be at least 21 years of age.

Annotated entities:
- Value: "at least 21 years"
- Person: "age"